What is the function of the HSJ1 proteins?

HSJ1 is a neuronal enriched member of the HSP40/DNAJ co-chaperone family.